Clinical trial inclusion criterion:
Older than the age of legal consent (i.e. 18 years old)

Annotated entities:
- Value: "Older than the age of legal consent"
- Person: "age"
- Value: "18 years old"